Los micoplasmas:
1. No contienen fosfolípidos en su membrana.
2. Poseen una pared de tipo Gram positivo.
3. Contienen ácidos micólicos.
4. Crecen rápidamente en medios simples.
5. Son naturalmente insensibles a la penicilina.

Respuesta correcta: 5. Son naturalmente insensibles a la penicilina.